下列何者為最常見的惡性皮膚腫瘤？
A. 基底細胞癌（basal cell carcinoma）
B. 狀細胞癌（squamous cell carcinoma）
C. 黑色素細胞瘤（melanoma）
D. 梅克爾氏細胞癌（Merkel cell carcinoma）

正確答案：A. 基底細胞癌（basal cell carcinoma）